下列有關認知行為治療（cognitive-behavior therapy）的敘述，何者錯誤？
A. 個人的情緒反應常會受到對某事件的認知所影響
B. 認知行為治療常用於急性疼痛（acute pain）的治療
C. 認知行為治療常用於憂鬱症（depressive disorders）的治療
D. 認知行為治療可強化個人的適應（adjustment）

正確答案：B. 認知行為治療常用於急性疼痛（acute pain）的治療